腦中風病人常發生患側肩關節疼痛僵硬等問題，下列敘述何者錯誤？
A. 腦中風病人約 70-80%有肩關節問題
B. 維持被動性關節活動與肩外展運動最為重要
C. 急性期不可使用肩帶或吊帶，以免僵硬惡化
D. 肩關節問題發生在病人痙攣期（spastic phase）比無力期（flaccid phase）多

正確答案：C. 急性期不可使用肩帶或吊帶，以免僵硬惡化